Clinical trial exclusion criterion:
Patients with 2 or more doses of methylprednisolone/prednisone per day

Annotated entities:
- Multiplier: "2 or more doses per day"
- Drug: "methylprednisolone"
- Drug: "prednisone"